Clinical trial exclusion criterion:
Drugs with a known impact on the immune system or on platelet function must be recorded and an exclusion of the study should be discussed with the study center

Annotated entities:
- Subjective_judgement: "Drugs with a known impact on the immune system or on platelet function must be recorded and an exclusion of the study should be discussed with the study center"